有關裘馨式肌肉失養症（Duchenne's muscular dystrophy）之臨床表徵描述，下列何者錯誤？
A. 為性聯隱性遺傳
B. 因缺乏 dystrophin 蛋白所造成
C. 發病年齡通常在 20 歲以上
D. 肌肉酵素 CK 之上升通常大於正常值 10 倍以上

正確答案：C. 發病年齡通常在 20 歲以上